Drug-induced hypotension, if necessary, evaluate patient after discontinuing the causative drug for one month

The above is a clinical trial exclusion criterion. Annotated with entity spans:
[Qualifier: Drug-induced] [Condition: hypotension], [Non-representable: if necessary, evaluate patient after discontinuing the causative drug for one month]